Asherman's syndrome 最佳的診斷方式為：
A. 診斷性子宮鏡
B. 診斷性腹腔鏡
C. 電腦斷層攝影
D. 超音波檢查

正確答案：A. 診斷性子宮鏡